一位 56 歲停經婦女，育有一男一女，長期服用荷爾蒙藥物改善更年期症狀，因電視報導乳癌發生率上升，心生恐懼，至門診求診。乳房檢查外觀對稱，皮膚無凹陷，觸診兩側乳房皆有光滑小結節。安排乳房攝影檢查（mammography），檢查結果報告為 BI-RADS category：0。下列何者是門診醫師對病患最適宜的建議？
A. 每年定期乳房攝影檢查追蹤
B. 每半年定期超音波檢查追蹤
C. 近期內需安排進一步影像學檢查
D. 需立即安排門診粗針穿刺檢查（core needle biopsy）

正確答案：C. 近期內需安排進一步影像學檢查